Pregnant

The above is a clinical trial exclusion criterion. Annotated with entity spans:
[Condition: Pregnant]